Clinical trial inclusion criterion:
Venous pH less than 7.25

Entity relations:
- Has_value("Venous pH", "less than 7.25")